multiple injuries (polytrauma patients)

The above is a clinical trial exclusion criterion. Annotated with entity spans:
[Condition: multiple injuries] ([Condition: polytrauma] patients)